Clinical trial exclusion criterion:
Patients who are considered by the investigator, for any reason, to be unable to self-administer the inhalation device.

Annotated entities:
- Post-eligibility: "Patients who are considered by the investigator, for any reason, to be unable to self-administer the inhalation device"